Clinical trial exclusion criterion:
Other Medications: Participants who are taking other medications on a routine basis must be on a stable dose for at least 4 weeks prior to the Preliminary Screening Period (P1), and must intend to continue the medication at the same regimen for the duration of the trial unless lack of efficacy, safety, or tolerability dictates otherwise. The following medications are not excluded:

Entity relations:
- Has_temporal("stable dose", "for at least 4 weeks prior to the Preliminary Screening Period (P1)")
- Has_qualifier("medications", "other")
- Has_multiplier("medications", "on a routine basis")
- Has_qualifier("medications", "stable dose")